15歲女病患，有家族性易出血現象，她易流鼻血、月經量多、貧血。血液檢	結果顯示：bleeding time超過30分鐘，PT 10 秒 （control 11秒），aPTT 48秒（control 30秒），Hb 5.0g/dL， platelet count 480×103/mm3。最可能的診斷為：
A. hemophilia A
B. hemophilia B
C. von Willebrand disease
D. Bernard-Soulier syndrome

正確答案：C. von Willebrand disease